Clinical trial exclusion criterion:
Contraindications for Magnetic resonance (MR) scanning such as persons with cardiac pacemaker and implants out of metal or claustrophobia

Annotated entities:
- Condition: "Contraindications"
- Procedure: "Magnetic resonance (MR) scanning"
- Device: "cardiac pacemaker"
- Device: "implants out of metal"
- Condition: "claustrophobia"